55歲有糖尿病的徐女士於2週前接受乳房攝影檢查，今天回診除看糖尿病外，並且要看乳房攝影檢查的報告，報告上寫 BIRADS category 0（0級），接下來給她何種建議?
A. 建議她趕快去看乳房外科並幫忙預約乳房外科門診，以免疾病拖太久
B. 告訴她第4級及以上才是比較有惡性病變的可能，暫時觀察等明年再檢查就可以
C. 告訴她0級表示沒有腫瘤，可兩年再檢查一次即可
D. 告訴她0級表示不能排除有異狀，將為她安排乳房超音波檢查來協助進一步診斷

正確答案：D. 告訴她0級表示不能排除有異狀，將為她安排乳房超音波檢查來協助進一步診斷